下列何者可進行間質性生長（interstitial growth）？①透明軟骨（hyalin cartilage） ②彈性軟骨（elastic cartilage） ③纖維軟骨（fibrocartilage）
A. 只有①②
B. 只有①③
C. 只有②③
D. ①②③都可以

正確答案：D. ①②③都可以